Clinical trial inclusion criterion:
valid driver's license

Annotated entities:
- Observation: "valid driver's license"